Clinical trial inclusion criteria:
18-80 year, male or female.
Chronic Heart failure subjects with medical history of cardiac disease or other related cardiovascular disease.
Left ventricular ejection fraction (LVEF) less than or equal to (=<) 40 percent (%).
New York Heart Association (NYHA) class of II - IV
NYHA II : Slight limitation of physical activity. Comfortable at rest, but ordinary physical activity results in undue breathlessness, fatigue or palpitation.
NYHA III:Marked limitation of physical activity. Comfortable at rest, but less than ordinary activity causes undue breathlessness, fatigue or palpitation.
NYHA IV:Unable to carry on any physical activity without discomfort. Symptoms at rest can be present. If any physical activity is undertaken, discomfort increased.
Signed Informed Consent Form (ICF).

Annotated entities:
- Person: "year"
- Value: "18-80"
- Person: "male"
- Person: "female"
- Condition: "Chronic Heart failure"
- Condition: "cardiac disease"
- Condition: "cardiovascular disease"
- Qualifier: "related"
- Measurement: "Left ventricular ejection fraction"
- Measurement: "LVEF"
- Value: "less than or equal to 40 percent"
- Value: "=< 40 %"
- Measurement: "New York Heart Association class"
- Value: "II - IV"
- Measurement: "NYHA"
- Non-query-able: "NYHA II : Slight limitation of physical activity. Comfortable at rest, but ordinary physical activity results in undue breathlessness, fatigue or palpitation"
- Non-query-able: "NYHA III:Marked limitation of physical activity. Comfortable at rest, but less than ordinary activity causes undue breathlessness, fatigue or palpitation"
- Non-query-able: "NYHA IV:Unable to carry on any physical activity without discomfort. Symptoms at rest can be present. If any physical activity is undertaken, discomfort increased"
- Post-eligibility: "Signed Informed Consent Form (ICF)"